Clinical trial exclusion criterion:
Participation in another clinical trial.

Annotated entities:
- Non-query-able: "Participation in another clinical trial."